Healthy males between 18 and 45 years of age (inclusive).

The above is a clinical trial inclusion criterion. Annotated with entity spans:
[Condition: Healthy] males [Value: between 18 and 45 years] of [Person: age] (inclusive).